下列有關心房震顫（atrial fibrillation）之敘述，何者錯誤？
A. 藥物療法除了心率控制以外，須包括抗凝血療法以減少血栓產生
B. 手術適應症包括藥物治療無效合併心房震顫引起之心肌病變、無法接受抗心律不整藥物或抗凝血藥物的治療
C. 目前ablation術式包括冷凍療法（cryoablation）、微波燒灼（microwave）、雷射燒灼（laser）等
D. 目前外科手術中，cut-and-sew Cox-Maze III procedure術後約只有一半的病患可跳回正常的竇性心律

正確答案：D. 目前外科手術中，cut-and-sew Cox-Maze III procedure術後約只有一半的病患可跳回正常的竇性心律